Which type of cells is affected in Amyotrophic Lateral Sclerosis?

Amyotrophic lateral sclerosis (ALS) is a neurodegenerative disorder in which motor neurons are affected.